Inmate of a correctional facility (i.e. prisoners).

The above is a clinical trial exclusion criterion. Annotated with entity spans:
[Person: Inmate of a correctional facility] (i.e. [Person: prisoners]).